38歲婦女，經診斷為子宮頸	狀上皮癌，接受根除性子宮切除術及骨盆腔淋巴結廓清術（radical  hysterectomy and bilateral pelvic lymph node dissection），根據Berek & Novak's Gynecology 15版2012年出版教科書的危險因子說明，下列何者非屬復發有關的高風險的因子？
A. 靠近邊緣，或切端邊緣有腫瘤（positive or close margins）
B. 大腫瘤（large tumor size）
C. 淋巴結有轉移（positive lymph nodes）
D. 顯微鏡檢下有子宮旁結締組織侵犯（microscopic parametrial involvement）

正確答案：B. 大腫瘤（large tumor size）